Need for dual organ transplant

The above is a clinical trial exclusion criterion. Annotated with entity spans:
[Mood: Need for] [Measurement: dual organ transplant]